History of alcohol abuse (defined as average intake of three or more units of alcohol per day) within 5 years of the Screening Visit.

The above is a clinical trial exclusion criterion. Annotated with entity spans:
[Temporal: History] of [Condition: alcohol abuse] (defined as average intake of [Multiplier: three or more units] of [Drug: alcohol] per day) [Temporal: within 5 years of the Screening Visit].